Clinical trial inclusion criterion:
Toxic epidermal necrolysis with SCORTEN 1 to 5 at admission

Entity relations:
- Has_index("at admission", "admission")
- Has_value("SCORTEN", "1 to 5")
- Has_temporal("SCORTEN", "at admission")